Prior radiotherapy for primary tumor

The above is a clinical trial exclusion criterion. Annotated with entity spans:
[Temporal: Prior] [Procedure: radiotherapy] for [Qualifier: primary] [Condition: tumor]